Clinical trial inclusion criterion:
Patients must be more than 18 years of age and referred for coronary angiography

Annotated entities:
- Value: "more than 18 years"
- Person: "age"
- Procedure: "coronary angiography"
- Mood: "referred for"